Clinical trial inclusion criterion:
No cognitive deficits

Entity relations:
- Has_negation("cognitive deficits", "No")